Completion of screening visit where ovulation will be assessed with blood draw for progesterone level (must be 5ng/mL or greater)

The above is a clinical trial inclusion criterion. Annotated with entity spans:
Completion of screening visit where ovulation will be assessed with blood draw for [Measurement: progesterone level] (must be [Value: 5ng/mL or greater])